Clinical trial inclusion criterion:
teriflunomide; continuously for no less than 5 years.

Entity relations:
- Has_multiplier("teriflunomide", "continuously")
- Has_temporal("teriflunomide", "for no less than 5 years")